Postural instability and gait disturbance phenotype

The above is a clinical trial inclusion criterion. Annotated with entity spans:
[Condition: Postural instability] and [Condition: gait disturbance] phenotype